Clinical trial inclusion criterion:
Hemoglobin > 11g/dl,

Entity relations:
- Has_value("Hemoglobin", "> 11g/dl")